Gastrectomy (subtotal or total)

The above is a clinical trial inclusion criterion. Annotated with entity spans:
[Procedure: Gastrectomy] ([Qualifier: subtotal] or [Qualifier: total])